一位 4 歲小男孩洗澡時，媽媽發現其右腹部有凸出的腫塊，經超音波檢查確定是約 8 公分大的腫瘤，手術後病理診斷為腎上腺惡性腫瘤，下列何種基因變異最可能？
A. N-myc 基因增幅變異
B. p53 基因點狀突變
C. c-myc 基因轉位
D. RB 基因刪除

正確答案：A. N-myc 基因增幅變異